一位 35 歲男性因為二週來有疲倦、茶色尿、皮膚變黃而來診所看診，他一個月前有至中國大陸旅行， 為了診斷他是否患有急性 A 型肝炎，應該做下列那項檢驗？
A. anti-HAV IgM
B. anti-HAV IgG
C. anti-HAV IgA
D. anti-HAV IgE

正確答案：A. anti-HAV IgM